下列有關退化性關節炎的治療，何者是最主要的方法？
A. 服用 glucosamine
B. 減輕退化關節的負擔
C. 持續服用消炎止痛劑
D. 浸泡溫泉或溫水

正確答案：B. 減輕退化關節的負擔